王小姐是一位 30 歲的乳癌末期病人，因為癌症多處骨頭轉移及肺轉移導致疼痛及氣喘而住院。王小姐的疼痛經過多種藥物治療仍然無法有效控制，這時最合適的處置方法是什麼？
A. 應懷疑王小姐的抱怨是否真實
B. 用藥以單一處方，不宜合併多種藥物
C. 評估心理、社會與靈性的需求
D. 考慮使用試驗中的化療藥物治療

正確答案：C. 評估心理、社會與靈性的需求